Clinical trial inclusion criteria:
Patients with informed consents
Without basal disorders of neurology and psychiatrics

Annotated entities:
- Informed_consent: "Patients with informed consents"
- Condition: "basal disorders of neurology"
- Condition: "basal disorders of psychiatrics"
- Negation: "Without"